Clinical trial exclusion criterion:
With immunosuppression (i.e. HIV, lymphoma)

Entity relations:
- Subsumes("immunosuppression", "HIV")
- OR("HIV", "lymphoma")